Chronic low back pain

The above is a clinical trial inclusion criterion. Annotated with entity spans:
[Condition: Chronic low back pain]